Clinical trial exclusion criterion:
Current severe depression (HAM-D >24) or anxiety (HAM-A >24)

Annotated entities:
- Temporal: "Current"
- Qualifier: "severe"
- Condition: "depression"
- Measurement: "HAM-D"
- Value: ">24"
- Condition: "anxiety"
- Measurement: "HAM-A"
- Value: ">24"
- Qualifier: "severe"